Clinical trial exclusion criterion:
The patient has bony lesions as the sole evaluable disease.

Annotated entities:
- Condition: "bony lesions"
- Value: "the sole"
- Qualifier: "evaluable disease"